Developed side effects within 2 weeks of initiation

The above is a clinical trial inclusion criterion. Annotated with entity spans:
Developed [Condition: side effects] [Temporal: within 2 weeks of initiation]